韓國首爾大學調查委員會 2005 年底宣布：黃禹錫培育的所謂特製胚胎幹細胞是假的，不是他所說的與患者體細胞基因相同的特製胚胎幹細胞，而是受精卵幹細胞。首爾大學研究處處長盧貞惠在新聞發表會上說：「3 家外部機構對 2、3 號幹細胞進行分析，結果證實與患者體細胞 DNA 不一致。」對此，黃禹錫立刻宣布辭去首爾大學教授職務，但堅持說擁有培育患者匹配型幹細胞的技術。請問黃禹錫宣稱用來製造胚胎幹細胞的技術，最有可能是下列何種？
A. genetic engineering
B. somatic cell nuclear transfer
C. chimeric hybridization
D. gonadal cell nuclear transfer

正確答案：B. somatic cell nuclear transfer